En la Terapia Racional Emotiva el concepto de “ansiedad del yo” se refiere al malestar que experimentan las personas cuando:
1. Presentan creencias relacionadas con incompetencias o descalificación personal.
2. Consideran que tienen que conseguir lo que desean.
3. Consideran que su bienestar está amenazado.
4. No toleran y les parecen terribles las situaciones desagradables de la vida.

Respuesta correcta: 1. Presentan creencias relacionadas con incompetencias o descalificación personal.